Major spine surgery scheduled as part of clinical care

The above is a clinical trial inclusion criterion. Annotated with entity spans:
[Procedure: Major spine surgery] scheduled as part of clinical care